Clinical trial exclusion criterion:
any confirmed or suspected immunodeficiency condition, including human immunodeficiency virus (HIV) infection, haematological malignancy, or a congenital immunodeficiency

Entity relations:
- Subsumes("human immunodeficiency virus infection", "HIV")
- Subsumes("immunodeficiency condition", "human immunodeficiency virus infection")
- Has_qualifier("immunodeficiency condition", "suspected")
- Has_qualifier("immunodeficiency condition", "confirmed")
- OR("human immunodeficiency virus infection", "congenital immunodeficiency", "haematological malignancy")